11. Known or suspected allergy/hypersensitivity to any agent given in the course of this trial.

The above is a clinical trial exclusion criterion. Annotated with entity spans:
11. [Post-eligibility: Known or suspected allergy/hypersensitivity to any agent given in the course of this trial].